Sobre el uso del neurofeedback para el tratamiento del TDAH en niños, podemos afirmar que:
1. Utiliza los mecanismos del condicionamiento clásico.
2. Se trata de un entrenamiento de la actividad eléctrica cerebral.
3. Los juegos muy complejos y divertidos suelen ser más eficaces.
4. Esta recomendado en casos con baja motivación hacia el tratamiento.

Respuesta correcta: 2. Se trata de un entrenamiento de la actividad eléctrica cerebral.